Patient has given written informed consent prior to any study-specific procedures. Patients with psychiatric or addictive disorders which prevent them from giving their informed consent must not enter the study.

The above is a clinical trial inclusion criterion. Annotated with entity spans:
Patient has given written informed consent prior to any study-specific procedures. Patients with [Condition: psychiatric] or [Condition: addictive disorders] which [Negation: prevent] them from [Observation: giving] their informed consent must not enter the study.